Clinical trial exclusion criterion:
Severe allergies

Entity relations:
- Has_qualifier("allergies", "Severe")